進行全靜脈營養（total parenteral nutrition，TPN）時，下列與中央靜脈導管相關之併發症的敘述，何者錯誤？
A. 導管內血栓（thrombus）
B. 氣胸（pneumothorax）
C. 臂叢神經損傷（brachial plexus injury）
D. 尿路感染（urinary tract infection）

正確答案：D. 尿路感染（urinary tract infection）